aged 3-13 years

The above is a clinical trial inclusion criterion. Annotated with entity spans:
[Person: aged] [Value: 3-13 years]